Clinical trial inclusion criterion:
Written student consent assent for those under the age of 18 (or if 18 years old and older consent for themselves)

Annotated entities:
- Informed_consent: "Written student consent assent for those under the age of 18 (or if 18 years old and older consent for themselves)"